當病患坐在輪椅上髖部有內旋（internal rotation）的問題時，下列敘述何者正確？
A. 須檢查是否有髖部脫位（dislocation）的問題
B. 輪椅椅座（seat）深度太長
C. 可能是因為髖關節過於屈曲（flexion），此時可將髖關節調整在較伸展（extension）的姿勢
D. 將有問題的一肢穿上踝足支架（ankle-foot orthosis）可改善此問題

正確答案：A. 須檢查是否有髖部脫位（dislocation）的問題